Clinical trial inclusion criterion:
TDF to TAF/TAF-containing fixed-dose combination regimens

Entity relations:
- AND("TAF-containing fixed-dose combination regimens", "TAF")
- AND("TAF-containing fixed-dose combination regimens", "TDF")